臨床上最廣泛使用來估算兒童腎絲球過濾率（Estimated GFR）的公式或指標為何？
A. Modification of Diet in Renal Disease（MDRD）公式
B. Schwartz formula
C. Cockcroft-Gault equations
D. 血中肌酸酐濃度（Creatinine）

正確答案：B. Schwartz formula